最近醫院評鑑很重視醫學倫理，要求在醫院年度計畫中應有醫學倫理議題，針對這個現象，下列敘述何者正確？
A. 醫院應該以營利為目的，管理與倫理是相衝突
B. 醫學倫理是醫師的事，跟醫院無關
C. 醫院和全體員工都應該努力促進醫學倫理
D. 醫學倫理是民眾對醫院的無理要求，不需要重視

正確答案：C. 醫院和全體員工都應該努力促進醫學倫理